Clinical trial exclusion criterion:
Myastheny

Annotated entities:
- Condition: "Myastheny"